El tejido conjuntivo denso ordenado o modelado forma parte de:
1. Estroma hemopoyético.
2. Tendones.
3. Mucosa digestiva.
4. Mucosa del útero.
5. Esclerótica.

Respuesta correcta: 2. Tendones.